Direct bilirubin < 2.0 x ULN

The above is a clinical trial inclusion criterion. Annotated with entity spans:
[Measurement: Direct bilirubin] [Value: < 2.0 x ULN]